Clinical trial inclusion criterion:
Subjects must be pre-adolescent without any signs of puberty (Tanner Stage 1).

Annotated entities:
- Person: "pre-adolescent"
- Condition: "signs of puberty"
- Negation: "without any"
- Measurement: "Tanner Stage"
- Value: "1"